Clinical trial exclusion criterion:
Documented thromboembolic event (including TIA) within the past 12 months (365 days)

Entity relations:
- Subsumes("thromboembolic event", "TIA")
- Has_temporal("thromboembolic event", "within the past 12 months")
- OR("within the past 12 months", "within the past 365 days")